在前列腺肥大之老年人用藥不慎時，可能會造成急性尿滯留（urinary retention）。下列何種藥物最不 可能引起此不良反應？
A. captopril
B. diphenhydramine
C. haloperidol
D. oxybutynin

正確答案：A. captopril